Entre las 24 y 36 horas después de producirse el pico de máxima liberación de la hormona LH se desencadena:
1. La menstruación.
2. La maduración del folículo De Graaf.
3. La ovulación.
4. La ovogénesis.
5. La formación del folículo primordial.

Respuesta correcta: 3. La ovulación.